病人 46 歲女性，慢性腎衰竭，規則血液透析 6 年，一年前開始有骨頭疼痛及皮膚發癢感，經查血鈣 11.0 mg/dL（8.5-10.5），磷 5.7 mg/dL（2.7-4.5），iPTH 1045 pg/mL（12-65），經給予降磷劑及維他命 D3 治療後，鈣降至 9.0 mg/dL，磷降至 4.2 mg/dL，iPTH 750 pg/mL，症狀減輕，但經過 2 個月後，骨頭疼痛及皮膚發癢等症狀再度發作，經檢查 iPTH 1650 pg/mL，鈣 11.5 mg/dL，而且副甲狀腺核醫掃描發現二側上下副甲狀腺腫大，下列何者是最好的治療？
A. 維他命 D3 口服 0.5 mg/QD
B. 口服類固醇治療
C. aluminum hydroxy 膠囊口服 3 顆/QD
D. 副甲狀腺切除術

正確答案：D. 副甲狀腺切除術